Una mujer de 23 años acude a urgencias por encontrarse muy nerviosa tras una discusión con su pareja. En su historia clínica se reflejan varias demandas semejantes en el año anterior, en dos de ellas tras un gesto autolítico. Se constatan también conflictos frecuentes en las relaciones de pareja, cambios laborales y discusiones familiares. Dice sentirse incomprendida por todos incluidos los psiquiatras que la atienden. El diagnóstico sería:
1. Trastorno de la personalidad límite.
2. Trastorno de la personalidad histriónico.
3. Distimia.
4. Trastorno disociativo.
5. Trastorno de despersonalización.

Respuesta correcta: 1. Trastorno de la personalidad límite.